Clinical trial exclusion criterion:
Subjects who have received valproic acid for treatment of epilepsy within 30 days of enrollment

Entity relations:
- causal("treatment", "epilepsy")
- Has_index("within 30 days of enrollment", "enrollment")
- Has_temporal("epilepsy", "within 30 days of enrollment")
- causal("valproic acid", "epilepsy")